Clinical trial exclusion criterion:
Concurrent participation in other investigational study

Annotated entities:
- Competing_trial: "Concurrent participation in other investigational study"